下列有關胃癌的敘述，何者錯誤？
A. 胃癌的成因，飲食為重要的因子
B. 所謂早期胃癌指僅侵犯到黏膜和黏膜下層
C. 革囊狀胃（linitis plastica）是用來描述胃癌 Borrmann type Ⅳ
D. 早期胃癌不可能有淋巴結轉移

正確答案：D. 早期胃癌不可能有淋巴結轉移